Entre las actividades expuestas a continuación, seleccione cuál es la actividad asistencial de la enfermera integrada en un equipo de atención primaria:
1. Indicar a una residente de Enfermería Familiar y Comunitaria la utilidad de los cuestionarios para establecer la dependencia de personas de 65 y más años.
2. Conocer la prevalencia de la capacidad funcional de la población de personas de 65 y más años, residentes en la zona básica de salud.
3. Presentar la sesión “Valoración funcional en personas de 65 y más años, en residentes en el área de salud en función del género y residentes en el área de salud” al equipo.
4. Determinar el nivel de independencia de F. P. y de su marido, ambos de 78 años de edad, en visita al domicilio de la pareja.
5. Fundamentar el método utilizado para determinar la capacidad funcional de C. V. de 77 años de edad, a un estudiante de Enfermería.

Respuesta correcta: 4. Determinar el nivel de independencia de F. P. y de su marido, ambos de 78 años de edad, en visita al domicilio de la pareja.